Clinical trial exclusion criterion:
Current renal (creatinine>2x upper limit of normal (ULN), dialysis, kidney transplant) or hepatic dysfunction (AST/ALT>2x ULN, liver transplant or neoplasm)

Entity relations:
- Has_value("creatinine", ">2x upper limit of normal (ULN)")
- Has_value("ALT", ">2x ULN")
- Has_value("AST", ">2x ULN")
- Subsumes("hepatic dysfunction", "AST")
- Subsumes("renal dysfunction", "creatinine")
- OR("creatinine", "kidney transplant", "dialysis")
- OR("renal dysfunction", "hepatic dysfunction")
- OR("AST", "ALT")
- OR("AST", "neoplasm", "liver transplant")